Clinical trial exclusion criterion:
History of steroid or immunosuppressive drug use within 6 months of surgery

Annotated entities:
- Drug: "steroid"
- Drug: "immunosuppressive drug"
- Temporal: "within 6 months of surgery"
- Reference_point: "surgery"